下列何者的肌腱外側可測得橈動脈（radial artery）之脈動？
A. 橈側伸腕長肌（Extensor carpi radialis longus）
B. 外展拇長肌（Abductor pollicis longus）
C. 肱橈肌（Brachioradialis）
D. 橈側屈腕肌（Flexor carpi radialis）

正確答案：D. 橈側屈腕肌（Flexor carpi radialis）